Clinical trial exclusion criteria:
Current unstable medical condition (e.g. unstable angina, myocardial infarction or coronary revascularization in the preceding 12 months, cardiac failure, chronic renal failure, chronic hepatic disease, severe pulmonary disease, blood disorders, poorly controlled diabetes, chronic infection)

Annotated entities:
- Condition: "unstable medical condition"
- Qualifier: "unstable"
- Temporal: "Current"
- Condition: "unstable angina"
- Condition: "myocardial infarction"
- Procedure: "coronary revascularization"
- Temporal: "in the preceding 12 months"
- Condition: "cardiac failure"
- Condition: "chronic renal failure"
- Condition: "chronic hepatic disease"
- Condition: "pulmonary disease"
- Condition: "blood disorders"
- Condition: "diabetes"
- Qualifier: "controlled"
- Negation: "poorly"
- Condition: "chronic infection"
- Qualifier: "chronic"
- Qualifier: "severe"
- Qualifier: "chronic"
- Qualifier: "chronic"